惡性貧血（pernicious anemia）患者所伴隨發生的特殊神經病理學病變是在何部位？
A. 大腦白質
B. 脊髓
C. 大腦皮質
D. 小腦

正確答案：B. 脊髓